Clinical trial exclusion criterion:
Meet one of the above RA flare requirements

Annotated entities:
- Condition: "RA flare requirements"
- Multiplier: "one of"